Clinical trial inclusion criterion:
diagnosis of moderate to very severe COPD (FEV1 <80% predicted), according to the GesEPOC criteria, established at least 3 months

Annotated entities:
- Condition: "COPD"
- Qualifier: "moderate"
- Qualifier: "very severe"
- Measurement: "FEV1"
- Value: "<80% predicted"
- Measurement: "GesEPOC criteria,"
- Temporal: "at least 3 months"